Patients presenting for CMR evaluation of chest pain but without evidence of obstructive coronary artery disease either by coronary angiography or stress testing.

The above is a clinical trial inclusion criterion. Annotated with entity spans:
Patients presenting for CMR evaluation of [Condition: chest pain] but [Negation: without] evidence of [Condition: obstructive coronary artery disease] either by [Procedure: coronary angiography] or [Procedure: stress testing].